下列何種疾病，最常因為基因印記（genomic imprinting）之機制異常而造成？
A. 唐氏症（Down syndrome）
B. 多發性神經纖維瘤（neurofibromatosis）
C. Beckwith-Wiedemann 症候群
D. 范康尼氏貧血（Fanconi anemia）

正確答案：C. Beckwith-Wiedemann 症候群